Clinical trial exclusion criterion:
Combined P-glycoprotein and moderate CYP 3A4 inhibitor

Entity relations:
- Has_qualifier("CYP 3A4 inhibitor", "moderate")